Clinical trial exclusion criterion:
Currently in active alcohol withdrawal

Entity relations:
- Has_qualifier("alcohol withdrawal", "active")
- Has_temporal("alcohol withdrawal", "Currently")